Por su alto contenido de mercurio, la Agencia Española de Seguridad Alimentaria y Nutrición recomienda a las mujeres embarazadas no consumir:
1. Quesos blandos maduros, tipo Brie o Camembert.
2. Paté o foie-gras.
3. Peces grasos de gran tamaño.
4. Embutidos crudos.
5. Verduras de hoja verde.

Respuesta correcta: 3. Peces grasos de gran tamaño.